Clinical trial inclusion criterion:
Current substance/alcohol use disorder on structured interview (MINI Plus) Page 21 of 39 Commercial-in-Confidence

Annotated entities:
- Condition: "alcohol use disorder"
- Condition: "substance use disorder"
- Measurement: "structured interview"
- Measurement: "MINI Plus"